Clinical trial exclusion criterion:
Severe respiratory disease

Entity relations:
- Has_qualifier("respiratory disease", "Severe")